Other neuromuscular disease

The above is a clinical trial exclusion criterion. Annotated with entity spans:
Other [Condition: neuromuscular disease]